Clinical trial inclusion criterion:
Pectoral implanted device

Annotated entities:
- Device: "Pectoral implanted device"